List symptoms of congenital toxoplasmosis triad.

Classic triad of toxoplasmosis include hydrocephalus, cerebral calcification and chorioretinitis.